Clinical trial exclusion criterion:
Atrioventricular block of second or third degree (without a pacemaker).

Annotated entities:
- Condition: "Atrioventricular block of second degree"
- Condition: "Atrioventricular block of third degree"
- Device: "pacemaker"
- Negation: "without"